Clinical trial exclusion criteria:
Patients who undergo iliac crest bone graft harvesting as part of their surgery
Preexisting neurological deficits or peripheral neuropathy in the distribution of the sciatic nerve
Local infection
Contraindication to regional anesthesia e.g. bleeding diathesis, coagulopathy
Chronic pain disorders
History of use of over 30mg oxycodone or equivalent per day
Allergy to local anesthetics
History of significant psychiatric conditions that may affect patient assessment
Pregnancy
Inability to provide informed consent

Annotated entities:
- Procedure: "iliac crest bone graft harvesting"
- Condition: "neurological deficits"
- Condition: "peripheral neuropathy"
- Qualifier: "sciatic nerve"
- Condition: "Local infection"
- Condition: "Contraindication"
- Procedure: "regional anesthesia"
- Condition: "bleeding diathesis"
- Condition: "coagulopathy"
- Condition: "Chronic pain"
- Multiplier: "over 30mg per day"
- Drug: "oxycodone"
- Drug: "oxycodone equivalent"
- Procedure: "local anesthetics"
- Condition: "Allergy"
- Non-query-able: "History of significant psychiatric conditions that may affect patient assessment"
- Condition: "Pregnancy"
- Informed_consent: "Inability to provide informed consent"